下列何者不屬於三核苷酸重複異常（trinucleotide-repeat disorder）？
A. 亨丁頓舞蹈症（Huntington's chorea）
B. 第三型脊髓小腦共濟失調（spinocerebellar ataxia type 3）
C. 甘迺迪病（Kennedy disease）
D. 運動神經元疾病（motor neuron disease）

正確答案：D. 運動神經元疾病（motor neuron disease）